major depressive episode in type2 bipolar disorder or bipolar disorder NOS.(MADRS more than 20 point)

The above is a clinical trial inclusion criterion. Annotated with entity spans:
[Condition: major depressive episode] in [Condition: type2 bipolar disorder] or [Condition: bipolar disorder] [Qualifier: NOS].([Measurement: MADRS] [Value: more than 20 point])